酮體（ketone bodies）不包括下列何者？
A. acetobutyrate
B. 3-hydroxybutyrate
C. acetone
D. acetoacetate

正確答案：A. acetobutyrate